Clinical trial inclusion criterion:
Informed consent must be obtained prior to any study procedure.

Annotated entities:
- Post-eligibility: "Informed consent must be obtained prior to any study procedure"